膝關節受傷扯斷脛側副韌帶（tibial collateral ligament），下列何者最可能同時受損？
A. 髕骨（patella）
B. 腓骨（fibula）
C. 內側關節盤（medial meniscus）
D. 外側關節盤（lateral meniscus）

正確答案：C. 內側關節盤（medial meniscus）